Clinical trial exclusion criterion:
Unable to give informed consent or follow the protocol

Annotated entities:
- Non-query-able: "Unable to give informed consent or follow the protocol"